Clinical trial exclusion criterion:
pregnant or lactating women;

Annotated entities:
- Pregnancy_considerations: "pregnant or lactating women"